El dato más comúnmente usado para estudiar la relación filogenética entre las bacterias es:
1. La composición en citosina-guanina de sus DNA.
2. El grado de hibridación DNA-DNA.
3. La secuencia de aminoácidos de las proteínas ribosomales.
4. La secuencia de nucleótidos de los RNA ribosómicos 16S.
5. La composición de la pared celular.

Respuesta correcta: 4. La secuencia de nucleótidos de los RNA ribosómicos 16S.